Clinical trial exclusion criterion:
Dementia or Mild cognitive impairment at baseline

Entity relations:
- Has_value("cognitive impairment", "Mild")
- multi("Mild cognitive impairment", "cognitive impairment")
- Has_temporal("Dementia", "at baseline")
- OR("Dementia", "Mild cognitive impairment")